Clinical trial exclusion criterion:
-Currently active or previously active inflammatory bowel disease during the 12 months prior to Visit 1 Currently active gastritis, duodenal or gastric ulcers, or gastrointestinal/rectal bleeding during the 3 months prior to Visit 1.

Entity relations:
- Has_temporal("inflammatory bowel disease", "during the 12 months prior")
- Has_temporal("inflammatory bowel disease", "Currently active")
- Has_temporal("gastritis", "Currently active")
- Has_temporal("gastritis", "during the 3 months prior")
- Has_temporal("duodenal", "Currently active")
- Has_temporal("gastric ulcers", "Currently active")
- Has_temporal("gastrointestinal bleeding", "Currently active")
- Has_temporal("duodenal", "during the 3 months prior")
- Has_temporal("gastric ulcers", "during the 3 months prior")
- Has_temporal("gastrointestinal bleeding", "during the 3 months prior")
- OR("Currently active", "previously active")
- OR("gastrointestinal bleeding", "rectal bleeding")